下列有關吞嚥困難（dysphagia）之敘述，何者最不正確？
A. 吞嚥困難的病患常發生吸入性肺炎
B. 吞嚥困難的腦中風病人，一般而言其功能性活動較差
C. 單側腦中風的病人一邊口腔咽喉正常，故不會發生吞嚥困難
D. 吞嚥困難常發生於腦幹中風（brain-stem stroke）的病人

正確答案：C. 單側腦中風的病人一邊口腔咽喉正常，故不會發生吞嚥困難